Las fuerzas que estabilizan la hélice alfa son:
1. Puentes de hidrógeno intracatenarios paralelos al eje de la hélice.
2. Puentes disulfuro entre metioninas.
3. Puentes de hidrógeno entre cadenas perpendiculares al eje de la hélice.
4. Fuerzas de van der Waals entre los radicales.
5. Enlaces entre radicales de lisina.

Respuesta correcta: 1. Puentes de hidrógeno intracatenarios paralelos al eje de la hélice.